真菌菌絲的細胞壁結構不包括：
A. 葡聚糖層（polysaccharide layer）
B. 脂多醣層（lipopolysaccharide layer）
C. 糖蛋白（glycoprotein）
D. 幾丁質層（chitin layer）

正確答案：B. 脂多醣層（lipopolysaccharide layer）